incapable of giving informed consent

The above is a clinical trial exclusion criterion. Annotated with entity spans:
[Post-eligibility: incapable of giving informed consent]